How many proteins have been queried for protein partners by the Drosophila protein interaction map (DPiM)?

5,000 proteins have been queried for protein partners by the Drosophila protein interaction map (DPiM).